What is Progeria?

Progeria is a rare genetic premature ageing disorder.